劉女士，57 歲，過去除自然生產兩次外無特殊疾病史，因不正常陰道出血至門診求診，經內診發現子宮頸有一 5 公分腫瘤，切片證實為子宮頸鱗狀上皮癌，腫瘤範圍至上 1/3 陰道後壁，腎盂攝影顯示右側輸尿管及腎盂水腫，電腦斷層未見淋巴結腫大，劉女士子宮頸癌期別至少為何？
A. 第一期下（I b）
B. 第二期上（II a）
C. 第二期下（II b）
D. 第三期下（III b）

正確答案：D. 第三期下（III b）